All patients that develop septic shock while in the ICU

The above is a clinical trial inclusion criterion. Annotated with entity spans:
All patients that develop [Condition: septic shock] [Temporal: while in the ICU]